Clinical trial exclusion criterion:
Mental retardation.

Annotated entities:
- Condition: "Mental retardation"